根據美國對兒童積液性中耳炎（otitis media with effusion）的處理指引，在無併發症的病例，積液性中耳炎病人在診斷後應密切觀察多久，才做進一步的聽力測試或手術治療？
A. 1個月
B. 2個月
C. 3個月
D. 6個月

正確答案：C. 3個月